下列何種疾病最不會引發新生兒延遲性黃疸症候群？
A. UTI（urinary tract infection）
B. CMV infection
C. hypothyroidism
D. Wilson disease

正確答案：D. Wilson disease